Evidence of congenital heart disease

The above is a clinical trial exclusion criterion. Annotated with entity spans:
[Mood: Evidence of] [Condition: congenital heart disease]